Local infection

The above is a clinical trial exclusion criterion. Annotated with entity spans:
[Condition: Local infection]